Hypertension with pregnancy.

The above is a clinical trial exclusion criterion. Annotated with entity spans:
[Condition: Hypertension] with [Condition: pregnancy].